Smokers.

The above is a clinical trial exclusion criterion. Annotated with entity spans:
[Observation: Smokers].